Clinical trial inclusion criterion:
Provide informed consent to participate in the study and understand that they may withdraw their consent at any time without prejudice to their future medical care.

Annotated entities:
- Informed_consent: "Provide informed consent to participate in the study and understand that they may withdraw their consent at any time without prejudice to their future medical care"